¿Qué tipo de epistasia explica la proporción fenotípica dihíbrida de 13:3?:
1. Doble dominante.
2. Simple recesiva.
3. Doble dominante recesiva.
4. Doble recesiva.
5. Simple dominante.

Respuesta correcta: 3. Doble dominante recesiva.